下列何者不是陰部神經（pudendal nerve）的分支？
A. 陰莖背神經（dorsal nerve of penis）
B. 下直腸神經（inferior rectal nerve）
C. 前陰囊神經（anterior scrotal nerve）
D. 後陰囊神經（posterior scrotal nerve）

正確答案：C. 前陰囊神經（anterior scrotal nerve）